Patients with upper face botulinum toxin injection in the past 12 months

The above is a clinical trial exclusion criterion. Annotated with entity spans:
Patients with [Qualifier: upper face] [Procedure: botulinum toxin injection] [Temporal: in the past 12 months]